Total weekly IgPro20 dose of = 50 mL (= 10 g).

The above is a clinical trial inclusion criterion. Annotated with entity spans:
Total [Qualifier: weekly] [Drug: IgPro20] dose of [Multiplier: = 50 mL] ([Multiplier: = 10 g]).